Clinical trial inclusion criteria:
patients with renal cancer coming to the laparoscopic radical nephrectomy

Annotated entities:
- Condition: "renal cancer"
- Qualifier: "laparoscopic"
- Procedure: "radical nephrectomy"